Clinical trial inclusion criterion:
4. Morphologically documented primary AML or AML secondary to myelodysplastic syndrome (MDS with ≥20% bone marrow or peripheral blasts), as defined by the World Health Organization (WHO) criteria, confirmed by pathology review at treating institution.

Entity relations:
- Has_qualifier("AML", "primary")
- Has_qualifier("AML", "primary")
- causal("myelodysplastic syndrome", "AML")
- causal("myelodysplastic syndrome", "AML")
- Has_qualifier("AML", "Morphologically documented")
- Has_qualifier("AML", "Morphologically documented")
- Has_value("bone marrow", "≥20%")
- AND("MDS", "bone marrow")
- Subsumes("myelodysplastic syndrome", "MDS")
- AND("myelodysplastic syndrome", "World Health Organization (WHO) criteria")
- AND("myelodysplastic syndrome", "pathology review")
- OR("AML", "AML")
- OR("bone marrow", "peripheral blasts")